Mariano es un señor de 53 años de edad que acude a su consulta refiriendo sentir un gran malestar desde hace ya unos años. Relaciona el malestar con una conducta que encuentra absurda pero que es incapaz de evitar. Esta conducta que lleva a cabo siempre al llegar a su casa de vuelta del trabajo consiste en accionar el pomo del baño del piso superior de la vivienda antes de hacer cualquier otra cosa, incluso antes de saludar a su familia. Algunas veces ha intentado resistirse a hacerlo pero solo ha conseguido angustiarse y demorar la conducta unos minutos. Éste comportamiento que Mariano realiza de un modo incoercible y automático es lo que se denomina:
1. Trastorno obsesivo-compulsivo.
2. Obsesión.
3. Impulsión.
4. Compulsión.

Respuesta correcta: 4. Compulsión.